willingness to complete protocol

The above is a clinical trial inclusion criterion. Annotated with entity spans:
[Informed_consent: willingness to complete protocol]